Which integrin genes are activated by the immune system in inflammatory bowel disease?

ITGA4, ITGB8, ITGAL and ICAM1. In all four cases, the expression-increasing allele also increases disease risk.